In which a cardiac catheterization is planned a priori to be performed via femoral, brachial or ulnar.

The above is a clinical trial exclusion criterion. Annotated with entity spans:
In which a [Procedure: cardiac catheterization] is planned a priori to be performed via [Qualifier: femoral], [Qualifier: brachial] or [Qualifier: ulnar].